Clinical trial inclusion criteria:
Community in a school district that is within the study area
Area within each school district that is in need of a well

Annotated entities:
- Visit: "school district that is within the study area"
- Visit: "school district that is in need of a well"